有關代謝症候群（metabolic syndrome），下列何者可增加胰島素阻抗（insulin resistance）？
A. 瘦素（leptin）及腫瘤壞死因子α（TNF α）
B. 腫瘤壞死因子α及 adiponectin
C. adiponectin 及 resistin
D. 腫瘤壞死因子α及 resistin

正確答案：D. 腫瘤壞死因子α及 resistin